endometrial hyperplasia with atypia,

The above is a clinical trial exclusion criterion. Annotated with entity spans:
[Condition: endometrial hyperplasia] [Qualifier: with atypia],